Clinical trial inclusion criterion:
3) major depressive disorder (PHQ-9 > 10) and diagnosed using the Structured Clinical Interview for Depression (SCID) according to the Diagnostic and Statistical Manual of Mental Disorders, Fourth Edition (DSM-IV),

Entity relations:
- Has_value("PHQ-9", "> 10")
- AND("major depressive disorder", "PHQ-9")
- AND("major depressive disorder", "Structured Clinical Interview for Depression (SCID) according to the Diagnostic and Statistical Manual of Mental Disorders, Fourth Edition (DSM-IV)")